Inpatient procedures for active GI bleeding

The above is a clinical trial exclusion criterion. Annotated with entity spans:
[Procedure: Inpatient procedures] for [Qualifier: active] [Condition: GI bleeding]